急性青光眼發作的病人所看到的虹視（halo vision）情形，是因為下列何者所引起？
A. 結膜水腫
B. 角膜水腫
C. 網膜水腫
D. 視神經乳頭水腫

正確答案：B. 角膜水腫